Where can you find the annulus of Zinn?

Annulus of Zinn is in the orbit.